Pleural or interstitial disease that precludes surgery.

The above is a clinical trial exclusion criterion. Annotated with entity spans:
[Condition: Pleural] or [Condition: interstitial disease] that [Qualifier: precludes surgery].